Evidence of clinically significant cardiac abnormalities, uncontrolled hypotension, left ventricular ejection fraction below the lower limit of normal for the site or experience of significant cardiac interventional procedures

The above is a clinical trial exclusion criterion. Annotated with entity spans:
Evidence of [Qualifier: clinically significant] [Condition: cardiac abnormalities], [Condition: uncontrolled hypotension], [Measurement: left ventricular ejection fraction] [Value: below the lower limit of normal] for the site or experience of [Qualifier: significant] [Procedure: cardiac interventional procedures]